當末期病人無法清楚表達意願時，可由其最近親屬代理決定，其優先順序，何者正確？
A. 配偶＞子女＞父母＞祖父母＞兄弟姐妹
B. 配偶＞父母＞子女＞祖父母＞兄弟姐妹
C. 父母＞配偶＞祖父母＞兄弟姐妹＞子女
D. 配偶＞子女＞父母＞兄弟姐妹＞祖父母

正確答案：D. 配偶＞子女＞父母＞兄弟姐妹＞祖父母